Clinical trial inclusion criterion:
patient with mild to severe carotid artery disease

Entity relations:
- Has_qualifier("carotid artery disease", "mild")
- OR("mild", "severe")